Known or suspected contraindications to the study medications, including history of allergy to Angiotensin converting enzyme (ACE) inhibitors and/or to thiazide diuretics or other sulfonamide derived drug

The above is a clinical trial exclusion criterion. Annotated with entity spans:
Known or suspected [Condition: contraindications] to the [Drug: study medications], including [Temporal: history of] [Condition: allergy] to [Drug: Angiotensin converting enzyme (ACE) inhibitors] and/or to [Drug: thiazide diuretics] or [Qualifier: other] [Drug: sulfonamide derived drug]